下列有關肺膿瘍（lung abscess）之敘述，何者錯誤？
A. 葡萄球菌菌血症常與它有關
B. 常合併膿胸
C. 大部分病人以內科治療即可
D. 大部分病人需以開刀治療才可痊癒

正確答案：D. 大部分病人需以開刀治療才可痊癒